一位 40 歲男性患者被家人送至精神科就醫，據家人描述患者近 1 個月心情沮喪、焦慮，失眠、坐立難安。其胃口也明顯變差，體重減輕 5 公斤，時時感到疲倦，提不起勁，雖可勉強上班，但曾多次提及輕生意念，經常感到無助、無望。此患者之臨床診斷最有可能為下列何者？
A. 廣泛性焦慮症（generalized anxiety disorder）
B. 恐慌症（panic disorder）
C. 重度憂鬱症（major depressive disorder）
D. 慮病症（hypochondriasis）

正確答案：C. 重度憂鬱症（major depressive disorder）